Clinical trial inclusion criterion:
Participants should be beneficiary of healthcare coverage under the social security system

Annotated entities:
- Observation: "beneficiary of healthcare coverage"